What is the function of the protein PIEZO1?

Piezo1 is a key element of the  mechanotransduction process and can transduce mechanical signals into biological signals by mediating Ca2+ influx, which in turn regulates cytoskeletal remodeling and stress alterations.